Clinical trial exclusion criterion:
Pseudocholinesterase deficiency

Annotated entities:
- Condition: "Pseudocholinesterase deficiency"